Clinical trial inclusion criterion:
Simple prophylactic cervical cerclage

Annotated entities:
- Qualifier: "prophylactic"
- Qualifier: "Simple"
- Procedure: "cervical cerclage"